What methodology does the Oncomine Dx target test use?

The Oncomine Dx target test uses the next generation sequencing methodology.